Clinical trial exclusion criterion:
Evidence of any GI disorder induced by an infection, underlying medical condition, or concomitant medication other than MPA

Entity relations:
- multi("induced by an infection", "infection")
- Has_qualifier("GI disorder", "induced by an infection")
- Has_negation("MPA", "other than")
- AND("medication", "MPA")
- OR("GI disorder", "underlying medical condition", "medication")